Clinical trial exclusion criterion:
Recurrent urogenital infections

Entity relations:
- Has_multiplier("urogenital infections", "Recurrent")